Clinical trial exclusion criterion:
Treated with hydroxyurea within 30 days;

Annotated entities:
- Drug: "hydroxyurea"
- Temporal: "within 30 days"